Clinical trial exclusion criterion:
6. Body weight exceeding 150 Kg

Annotated entities:
- Parsing_Error: "6."
- Measurement: "Body weight"
- Value: "exceeding 150 Kg"